抗體之效能作用（effector functions）由其分子中那一個部位決定？
A. 重鏈（heavy chain）之變異區（variable region）
B. 重鏈之不變區（constant region）
C. 輕鏈（light chain）之變異區
D. 輕鏈之不變區

正確答案：B. 重鏈之不變區（constant region）